Clinical trial exclusion criterion:
Subject has 2° type II, 3° degree AV-block or left/right bundle branch block pattern.

Entity relations:
- OR("2° type II AV-block", "right bundle branch block", "left bundle branch block", "3° degree AV-block")